¿Cuál de las siguientes enfermedades tiene su origen en una alteración de la beta-oxidación de los grasos de cadena muy larga?:
1. Enfermedad de Addison.
2. Enfermedad de Fabry.
3. Adrenoleucodistrofia.
4. Iminoglicinuria.

Respuesta correcta: 3. Adrenoleucodistrofia.